下列何者不是 CT 診斷 aortic dissection 的直接證據？
A. 可見剝離的內膜（intimal flap）在管腔中
B. 可見鈣化的內膜硬化斑（calcific plaques）向內位移（medial displacement）
C. 可見剝離的內膜鼓向假腔（false lumen）中
D. 下行主動脈直徑大於上行主動脈

正確答案：D. 下行主動脈直徑大於上行主動脈